Which type of analysis does DeSeq2 perform?

DeSeq2 supports differential gene expression analysis by combining multiple sources of evidence.